¿Cuál de los siguientes alcoholes presenta el menor valor de pKa?:
1. Etanol.
2. 2-Cloroetanol.
3. 2-Propanol.
4. 2,2,2-Trifluoroetanol.
5. 1,1-Dimetiletanol.

Respuesta correcta: 4. 2,2,2-Trifluoroetanol.